Abnormal resting ECG

The above is a clinical trial exclusion criterion. Annotated with entity spans:
[Value: Abnormal] [Procedure: resting ECG]